Clinical trial exclusion criterion:
Pregnancy, lactation.

Annotated entities:
- Condition: "Pregnancy"
- Condition: "lactation"